Prior hormonal therapy is allowed as:

The above is a clinical trial inclusion criterion. Annotated with entity spans:
[Temporal: Prior] [Procedure: hormonal therapy] [Mood: is allowed] as: